有關第三型過敏免疫反應，最正確的敘述為何？
A. 抗體辨識與結合細胞表面抗原，造成細胞壞死所產生的過度免疫反應
B. 主要參與反應的抗體為 IgE
C. 大量過度活化 TH1 與 CD8 T 細胞所致
D. 常因持續性病原菌感染所引發

正確答案：D. 常因持續性病原菌感染所引發